關於骨質疏鬆症之敘述，下列何者正確？
A. 乳癌病人停經後骨質流失較快，應儘早補充女性荷爾蒙（hormone replacement therapy）來預防骨質疏鬆
B. 骨質密度檢查目前最被採用的方式為跟骨超音波（quantitative ultrasound, QUS），既方便又沒有放射線曝露危險
C. 世界衛生組織定義 T-score＜-2.5 以下即為骨質疏鬆（osteoporosis）
D. 骨質疏鬆分為兩型，卵巢切除或停經屬於第二型

正確答案：C. 世界衛生組織定義 T-score＜-2.5 以下即為骨質疏鬆（osteoporosis）